Clinical trial exclusion criterion:
Refusal of treatment or contraindication to NeuroAiD

Annotated entities:
- Condition: "contraindication"
- Procedure: "NeuroAiD"